Left ventricular ejection fraction (LVEF) below 50% within approximately 28 days prior to randomization.

The above is a clinical trial exclusion criterion. Annotated with entity spans:
[Measurement: Left ventricular ejection fraction (LVEF)] [Value: below 50%] [Temporal: within approximately 28 days prior to randomization].